Clinical trial exclusion criterion:
Current use of anticholinergics or other medications with anticholinergic activity

Annotated entities:
- Drug: "anticholinergics"